use of NSAIDs in the 5 days before blood donation;

The above is a clinical trial exclusion criterion. Annotated with entity spans:
use of [Drug: NSAIDs] [Temporal: in the 5 days before blood donation];